Which type of myeloma is ixazomib being evaluated for?

The disease focus for the  irreversible epoxyketone proteasome inhibitor ixazomib is multiple myeloma.